Clinical trial inclusion criterion:
Age: 20-70 years old;

Entity relations:
- Has_value("Age", "20-70 years old")